原發性腦瘤中，以何種腫瘤最常見？
A. 星狀細胞瘤（astrocytoma)
B. 腦膜瘤（meningioma）
C. 室管膜瘤（ependymoma）
D. 髓母細胞瘤（medulloblastoma）

正確答案：A. 星狀細胞瘤（astrocytoma)